林先生幾次進出醫院治療他復發的鼻咽癌，但狀況一直變壞，於是他就跟主治醫師陳醫師多次的討論，有關他最後無法靠他自己的力量維持生命時的狀況，陳醫師當然跟他解釋了各式各樣的可能，林先生跟家人商討，決定如果在最後危急時，他不要做任何的插管，希望能夠安詳的離開人世間，陳醫師也表達會尊重他的意願。此時陳醫師應該建議林先生進行何種程序？
A. 簽署安樂死意願書
B. 簽署不施行心肺復甦術意願書
C. 請家屬簽署安樂死意願書
D. 請家屬簽署加工自殺意願書

正確答案：B. 簽署不施行心肺復甦術意願書